Clinical trial inclusion criterion:
Patients with a calculated PRA of 0% by solid phase technique and absence of anti-HLA class I and class II antibodies by single antigen test (Luminex®).

Annotated entities:
- Measurement: "calculated PRA"
- Value: "0%"
- Qualifier: "solid phase technique"
- Procedure: "single antigen test (Luminex®)"
- Observation: "absence of anti-HLA class I"
- Observation: "absence of class II"